Clinical trial exclusion criterion:
adults 61 years old and above

Annotated entities:
- Person: "adults"
- Value: "and above 61 years"
- Person: "old"